Patients who are pregnant or breast feeding

The above is a clinical trial exclusion criterion. Annotated with entity spans:
[Pregnancy_considerations: Patients who are pregnant or breast feeding]